Clinical trial exclusion criterion:
Administration of antineoplastic and immunomodulating agents or radiotherapy within 90 days prior to informed consent.

Entity relations:
- Has_index("within 90 days prior to informed consent", "informed consent")
- Has_temporal("antineoplastic agents", "within 90 days prior to informed consent")
- OR("antineoplastic agents", "radiotherapy", "immunomodulating agents")